Clinical trial exclusion criterion:
Inability to give informed consent

Annotated entities:
- Observation: "Inability to give informed consent"